Deformities or curvatures (including kyphosis, lordosis, or scoliosis)

The above is a clinical trial inclusion criterion. Annotated with entity spans:
[Condition: Deformities] or [Condition: curvatures] (including [Condition: kyphosis], [Condition: lordosis], or [Condition: scoliosis])